serious concomitant illness and malignant tumor of any kind

The above is a clinical trial exclusion criterion. Annotated with entity spans:
[Qualifier: serious] [Temporal: concomitant] [Condition: illness] and [Condition: malignant tumor] of [Qualifier: any kind]